5. Women who are pregnant or lactating.

The above is a clinical trial exclusion criterion. Annotated with entity spans:
5. [Pregnancy_considerations: Women who are pregnant or lactating].